Clinical trial exclusion criterion:
Significant medical problem that in the opinion of the investigator would preclude enrollment in this study

Annotated entities:
- Non-query-able: "ignificant medical problem that in the opinion of the investigator would preclude enrollment in this study"